Idiopathic Granulomatous Mastitis

The above is a clinical trial inclusion criterion. Annotated with entity spans:
[Condition: Idiopathic Granulomatous Mastitis]